Clinical trial exclusion criterion:
Conditions or pathologies supposed to alter gastric emptying times (Thyroid dysfunction, chronic renal failure, Parkinson's disease, scleroderma, amyloidosis, any gastrointestinal disease, any not cured malignancy, and any advanced psychiatric or neurological disease).

Annotated entities:
- Condition: "Thyroid dysfunction"
- Condition: "chronic renal failure"
- Condition: "Parkinson's disease"
- Condition: "scleroderma"
- Condition: "amyloidosis"
- Condition: "gastrointestinal disease"
- Condition: "malignancy"
- Condition: "psychiatric disease"
- Condition: "neurological disease"
- Qualifier: "advanced"
- Condition: "pathologies supposed to alter gastric emptying times"
- Condition: "Conditions supposed to alter gastric emptying times"